對於卵巢過度刺激症候群（ovarian hyperstimulating syndrome）的敘述，何者錯誤？
A. 超音波可見卵巢腫大，合併腹水
B. 施打利尿劑可改善胸水腹水，為治療首選
C. 若懷孕，症狀可能更加嚴重
D. 嚴重時可造成呼吸困難

正確答案：B. 施打利尿劑可改善胸水腹水，為治療首選